Clinical trial exclusion criterion:
History of allergic reactions to phenylephrine or ephedrine

Entity relations:
- Has_temporal("allergic reactions", "History")
- AND("allergic reactions", "phenylephrine")
- OR("phenylephrine", "ephedrine")